Una hemorragia:
1. Activa los barorreceptores arteriales.
2. Produce vasoconstricción periférica.
3. Reduce los niveles de ADH.
4. Inhibe el eje-renina-angiotensina-aldosterona.
5. Libera péptido atrial natriurético.

Respuesta correcta: 2. Produce vasoconstricción periférica.